El potasio forma numerosas sales solubles en agua y algunas pocas insolubles. Entre las insolubles se encuentran el:
1. Tetrafenilborato de potasio.
2. Dihidrogenofosfato de potasio.
3. Carbonato de potasio.
4. Dicromato de potasio.

Respuesta correcta: 1. Tetrafenilborato de potasio.